Schirmer: > 4 mm and < 14 mm

The above is a clinical trial inclusion criterion. Annotated with entity spans:
[Measurement: Schirmer]: [Value: > 4 mm and < 14 mm]